What is marked by DNaseI hypersensitive sites?

Yes, DNaseI hypersensitive sites have been shown to be markers for all types of active cis-acting regulatory elements, including promoters, enhancers, silencers, insulators, and locus control regions.